History of taking an alpha blocker (tamsulosin/ terazosin/doxazosin/alfuzosin/silodosin) medication

The above is a clinical trial inclusion criterion. Annotated with entity spans:
History of taking an [Drug: alpha blocker] ([Drug: tamsulosin]/ [Drug: terazosin]/[Drug: doxazosin]/[Drug: alfuzosin]/[Drug: silodosin]) medication